18 to 50 years old

The above is a clinical trial inclusion criterion. Annotated with entity spans:
[Value: 18 to 50 years] [Person: old]